Clinical trial inclusion criterion:
HbA1c (accordingly to IFCC) 47 mmol/mol - 110 mmol/mol.

Annotated entities:
- Measurement: "HbA1c"
- Value: "47 mmol/mol - 110 mmol/mol"